Clinical trial inclusion criterion:
Aspartate transaminase (AST) (SGOT) ≤ 2.5 X institutional ULN

Annotated entities:
- Measurement: "Aspartate transaminase (AST) (SGOT)"
- Value: "≤ 2.5 X institutional ULN"